Clinical trial exclusion criterion:
Contraindications of tranexamic acid, floseal, or rivaroxaban

Annotated entities:
- Condition: "Contraindications"
- Drug: "tranexamic acid"
- Drug: "floseal"
- Drug: "rivaroxaban"